下列何者不屬於膜上蛋白質之脂質錨定（lipid anchor）？
A. glycosyl phosphatidylinositol anchor
B. acetyl anchor
C. myristoyl anchor
D. thioether anchor

正確答案：B. acetyl anchor